evident intra-abdominal inflammation (diagnosed by imaging and/or laboratory results, including an abscess or cholecystitis)

The above is a clinical trial exclusion criterion. Annotated with entity spans:
evident [Condition: intra-abdominal inflammation] (diagnosed by [Procedure: imaging] and/or [Procedure: laboratory] results, including an [Condition: abscess] or [Condition: cholecystitis])